Clinical trial exclusion criterion:
History of heart transplant or on a transplant list or with left ventricular (LV) assistance device.

Entity relations:
- Has_temporal("heart transplant", "History")
- OR("heart transplant", "on a transplant list", "left ventricular (LV) assistance device")